有關人體骨骼肌三合體（triad）的敘述，下列何者正確？
A. 由終池和兩側的 T 小管所構成
B. 通常位在 Z 線上
C. 三合體的終池有貯存鈣離子的功能
D. T 小管是內質網膨大所形成

正確答案：C. 三合體的終池有貯存鈣離子的功能